Clinical trial exclusion criterion:
taken any structured behavioral or exercise programs in the past 3 months

Entity relations:
- Has_temporal("structured exercise programs", "in the past 3 months")
- OR("structured exercise programs", "structured behavioral programs")